Clinical trial exclusion criterion:
Renal disease unrelated to SLE (e.g. diabetes mellitus, other glomerular or tubulointerstitial disease, renovascular disease), or transplanted kidney.

Entity relations:
- Has_negation("SLE", "unrelated")
- AND("Renal disease", "SLE")
- Subsumes("Renal disease", "diabetes mellitus")
- OR("diabetes mellitus", "glomerular disease", "tubulointerstitial disease", "renovascular disease")
- OR("Renal disease", "transplanted kidney")